Clinical trial exclusion criterion:
Diagnosed with a medical or psychiatric illness that may interfere with study participation

Annotated entities:
- Condition: "illness that may interfere with study participation medical"
- Condition: "psychiatric illness that may interfere with study participation"